Subject is currently participating or plans to participate in any other investigational device or drug without prior approval from the Sponsor;

The above is a clinical trial exclusion criterion. Annotated with entity spans:
[Post-eligibility: Subject is currently participating or plans to participate in any other investigational device or drug without prior approval from the Sponsor];